Clinical trial exclusion criterion:
6. daily use of opioids for pain

Entity relations:
- AND("opioids", "pain")
- Has_multiplier("opioids", "daily")